Received an investigational or non-registered medicinal product within 30 days prior to informed consent.

The above is a clinical trial exclusion criterion. Annotated with entity spans:
Received an [Qualifier: investigational] or [Qualifier: non-registered] [Drug: medicinal product] [Temporal: within 30 days prior to informed consent].